下列有關蛋白質的結構敘述，何項正確？
A. 雙硫鍵（Disulfide bond）構成蛋白質的二級結構
B. 蛋白質都含有一至四級結構
C. 肌紅蛋白有四級結構
D. α helix 是常見的蛋白質二級結構

正確答案：D. α helix 是常見的蛋白質二級結構